臺灣目前的總體醫療保健支出，主要的財源來自下列那一項？
A. 慈善捐款
B. 商業保險
C. 社會保險
D. 稅收

正確答案：C. 社會保險